Clinical trial exclusion criterion:
Pregnancy or lactating

Entity relations:
- OR("Pregnancy", "lactating")